Clinical trial inclusion criterion:
MCI (MoCA >18<26 -inclusive of 1 point if <12 years of education Group 2

Entity relations:
- Has_value("MoCA", ">18<26")
- Subsumes("MCI", "MoCA")